Clinical trial exclusion criterion:
Renal insufficiency (Creatinine clearance < 30 mL/min)

Entity relations:
- AND("Renal insufficiency", "Creatinine clearance")
- Has_value("Creatinine clearance", "< 30 mL/min")